Clinical trial inclusion criterion:
Prior surgery, including tumor resection or metastasectomy must have been performed at least 4 weeks prior to study enrollment.

Entity relations:
- Has_index("at least 4 weeks prior to study enrollment", "study enrollment")
- Subsumes("surgery", "tumor resection")
- Has_temporal("surgery", "Prior")
- Has_temporal("surgery", "at least 4 weeks prior to study enrollment")
- OR("tumor resection", "metastasectomy")